Patients who are prescribed AEDs not listed in the trial IMPs

The above is a clinical trial exclusion criterion. Annotated with entity spans:
[Non-query-able: Patients who are prescribed AEDs not listed in the trial IMPs]